Cardiac morbidities

The above is a clinical trial exclusion criterion. Annotated with entity spans:
[Condition: Cardiac morbidities]